引起全身性感染的真菌大多數是何種真菌？
A. 產毒素真菌
B. 條件致病性真菌
C. 具有變異原性真菌
D. 多細胞真菌

正確答案：B. 條件致病性真菌